Which is the relation between sweating and anaerobic threshold?

There is no clear evidence of the relationship between sweating and anaerobic threshold